1. Patients with stable (Canadian Cardiovascular Society 1, 2, 3 or 4) or unstable (Braunwald class IB, IC, IIB, IIC, IIIB, IIIC) angina pectoris and ischemia, or patients with atypical chest pain or even those who are asymptomatic provided they have documented myocardial ischaemia (e.g. treadmill exercise test, radionuclide scintigraphy, stress echocardiography, Holter tape);

The above is a clinical trial inclusion criterion. Annotated with entity spans:
1. Patients with [Qualifier: stable] ([Measurement: Canadian Cardiovascular Society] [Value: 1, 2, 3 or 4]) or [Qualifier: unstable] ([Measurement: Braunwald class] [Value: IB], [Value: IC], [Value: IIB], [Value: IIC], [Value: IIIB], [Value: IIIC]) [Condition: angina pectoris] and [Condition: ischemia], or patients with [Condition: atypical chest pain] or even those who are [Condition: asymptomatic] provided they have [Observation: documented] [Condition: myocardial ischaemia] (e.g. [Procedure: treadmill exercise test], [Procedure: radionuclide scintigraphy], [Procedure: stress echocardiography], [Procedure: Holter tape]);